Clinical trial inclusion criterion:
resection should be more than two months,

Annotated entities:
- Condition: "resection"
- Temporal: "more than two months"